Affected by limited mental capacity or language skills such that study information cannot be understood, informed consent cannot be obtained, or simple instructions cannot be followed.

The above is a clinical trial exclusion criterion. Annotated with entity spans:
A[Post-eligibility: ffected by limited mental capacity or language skills such that study information cannot be understood, informed consent cannot be obtained, or simple instructions cannot be followed].